Which enhancers are characterized as latent?

Here, we describe latent enhancers, defined as regions of the genome that in terminally differentiated cells are unbound by TFs